下列有關基底細胞癌（basal cell carcinoma）的敘述，何者錯誤？
A. 轉移到其他器官的情形很常見
B. 臨床上以節結囊腫型（nodulocystic type）最多
C. 過量紫外線的暴露是導致基底細胞癌最主要的原因
D. 治療以切除為主

正確答案：A. 轉移到其他器官的情形很常見